Clinical trial exclusion criterion:
Subject has myxoma. Exclusion criteria based on laboratory abnormalities

Annotated entities:
- Condition: "myxoma"
- Non-query-able: "Exclusion criteria based on laboratory abnormalities"